Clinical trial inclusion criterion:
Simple prophylactic cervical cerclage

Entity relations:
- Has_qualifier("cervical cerclage", "prophylactic")
- Has_qualifier("cervical cerclage", "Simple")